Clinical trial exclusion criterion:
Chronic usage of analgesic drugs.

Annotated entities:
- Drug: "analgesic drugs"